Which neuropsychiatric disorders are associated with 16p13.11 genomic copy number variants?

16p13.11 genomic copy number variants are implicated in several neuropsychiatric disorders, such as schizophrenia, autism, mental retardation, ADHD and epilepsy.